What classes of drugs does Retapamulin belong to?

Retapamulin belongs to the class of gentamycin-resistant antibiotics.